Clinical trial exclusion criterion:
Intestinal obstruction syndrome

Annotated entities:
- Condition: "Intestinal obstruction syndrome"